Estimated IQ < 70

The above is a clinical trial exclusion criterion. Annotated with entity spans:
[Measurement: Estimated IQ] [Value: < 70]